李太太 56 歲，因急性闌尾炎而需要接受闌尾切除手術。李太太是尿毒症患者，過去 8 年來一直接受血液透析治療。在進行麻醉照會時，關於麻醉的風險，你特別向家屬說明心臟陣發性衰竭（cardiac episodic failure）的狀況，這是因為尿毒症患者合併有那一種病症？
A. 貧血
B. 低血壓
C. 高血鉀症
D. 高血鈣症

正確答案：A. 貧血